Patients undergoing elective abdominal surgery with an expected blood loss of = 500 ml

The above is a clinical trial inclusion criterion. Annotated with entity spans:
Patients undergoing [Qualifier: elective] [Procedure: abdominal surgery] with an [Measurement: expected blood loss] of [Value: = 500 ml]